Clinical trial exclusion criterion:
Patients who have previous prostate surgery Patients who have muscle invasive bladder cancer

Entity relations:
- Has_qualifier("bladder cancer", "muscle invasive")
- Has_temporal("prostate surgery", "previous")